思覺失調症（schizophrenia）患者所呈現之「新語症」（neologism），屬於下列何種障礙？
A. 知覺障礙
B. 語言障礙
C. 思考障礙
D. 行為障礙

正確答案：C. 思考障礙